Clinical trial exclusion criterion:
Elevated ALT or serum creatinine on screening or any clinically significant abnormalities on screening laboratory tests as determined by the Investigator.

Annotated entities:
- Measurement: "ALT"
- Value: "Elevated"
- Measurement: "serum creatinine"
- Temporal: "on screening"
- Reference_point: "screening"
- Measurement: "laboratory tests"
- Undefined_semantics: "laboratory tests"
- Subjective_judgement: "as determined by the Investigator"
- Non-query-able: "any clinically significant abnormalities on screening laboratory tests as determined by the Investigator"
- Value: "abnormalities"